Clinical trial exclusion criterion:
Spinal cord compression or brain metastases unless asymptomatic, treated and stable (not requiring steroids)

Annotated entities:
- Condition: "Spinal cord compression"
- Condition: "brain metastases"
- Condition: "asymptomatic"
- Negation: "unless"
- Qualifier: "treated"
- Qualifier: "stable"
- Drug: "steroids"
- Negation: "not"